La vía clásica del complemento se activa en respuesta a:
1. Complejos antígeno-anticuerpo.
2. Unión directa de C3b a paredes bacterianas.
3. Glicolípidos microbianos.
4. La properdina.
5. La proteína C-reactiva.

Respuesta correcta: 1. Complejos antígeno-anticuerpo.